1. History of colorectal surgery

The above is a clinical trial exclusion criterion. Annotated with entity spans:
[Parsing_Error: 1.] [Temporal: History] of [Procedure: colorectal surgery]